相較於靜脈營養，腸道營養對手術病人營養支持之好處，下列何者錯誤？
A. 吃進去的多醣（polysaccharides）在大腸會被細菌發酵（bacterial fermentation），以維持腸道正常菌落
B. 嚴重血流動力學不穩定（marked hemodynamic instability）的病人適合給與腸道營養
C. 有較好的腸胃道免疫功能（gastrointestinal immunity）
D. 可以維持腸胃屏障功能（gastrointestinal barrier function）

正確答案：B. 嚴重血流動力學不穩定（marked hemodynamic instability）的病人適合給與腸道營養